Clinical trial inclusion criterion:
Subject has bone abnormalities preventing safe screw fixation.

Annotated entities:
- Condition: "bone abnormalities"
- Procedure: "screw fixation"
- Negation: "preventing"
- Qualifier: "safe"